有關淋巴癌的敘述，下列何者正確？
A. 一旦血液中發現淋巴腫瘤細胞，就應歸類為白血病（leukemia）而非淋巴癌
B. 淋巴結外的被	細胞淋巴癌（mantle cell lymphoma）主要與幽門螺旋桿菌（Helicobacter pylori）有關
C. 無論是T細胞或B細胞淋巴癌，淋巴癌常常都會有抗原受體（antigen receptor）基因重組的現象
D. 在臺灣何杰金氏淋巴癌（Hodgkin lymphoma）較非何杰金氏淋巴癌（non-Hodgkin lymphoma）常見

正確答案：C. 無論是T細胞或B細胞淋巴癌，淋巴癌常常都會有抗原受體（antigen receptor）基因重組的現象